分娩時，胎頭先露部（presenting part）之檢查，下列何者最為合理？
A. 陰道內診
B. 超音波
C. 陰道鏡
D. 電腦斷層

正確答案：A. 陰道內診